Dementia.

The above is a clinical trial exclusion criterion. Annotated with entity spans:
[Condition: Dementia].